Clinical trial exclusion criterion:
Received any vaccine within a month prior to study vaccine

Entity relations:
- Has_temporal("vaccine", "within a month prior to study vaccine")
- Has_index("within a month prior to study vaccine", "study vaccine")